Clinical trial exclusion criterion:
lithium

Annotated entities:
- Drug: "lithium"